Known platelet count <80x106/mL

The above is a clinical trial exclusion criterion. Annotated with entity spans:
Known [Measurement: platelet count] [Value: <80x106/mL]